¿Cuál de los siguientes es un marcador más fiable de malnutrición en el paciente mayor?
1. Pérdida de peso de 1 kg en el último mes.
2. Índice de masa corporal mayor que 24.
3. Dificultad para tragar, masticar y/o falta de apetito.
4. Albúmina 4,5 gr/dl.
5. Mini Nutritional Assessment menor que 17.

Respuesta correcta: 5. Mini Nutritional Assessment menor que 17.